下列關於微創手術施行大腸切除的敘述，何者錯誤？
A. 腹腔鏡輔助大腸切除手術相較於開腹手術，能減少術後疼痛
B. 腹腔鏡輔助大腸切除手術產生腸繫膜內疝氣（mesenteric internal hernia）的比率約只有1%
C. 腹腔鏡輔助大腸切除手術施行大腸切除後，一定要手術關閉腸繫膜缺損（mesenteric defect）
D. 最常見腸繫膜內疝氣的位置在迴腸結（ileocolic junction）附近

正確答案：C. 腹腔鏡輔助大腸切除手術施行大腸切除後，一定要手術關閉腸繫膜缺損（mesenteric defect）